Clinical trial inclusion criteria:
French Native language
18 years old or older
Signed consent
Covered by the French social care system

Annotated entities:
- Observation: "French Native language"
- Value: "18 years or older"
- Person: "old"
- Informed_consent: "Signed consent"
- Observation: "Covered by the French social care system"